下列那一種蛋白質不參與人類嗅覺的訊息傳遞？
A. 三體 G 蛋白（trimeric G protein）
B. cAMP
C. 細胞膜鈣離子通道
D. STAT 轉錄因子

正確答案：D. STAT 轉錄因子